Clinical trial inclusion criterion:
interferon ß-1b,

Annotated entities:
- Drug: "interferon ß-1b"